Frente a un delirio celotípico hay que sospechar la existencia de:
1. SIDA.
2. Alcoholismo.
3. Demencia.
4. Personalidad esquizoide.

Respuesta correcta: 2. Alcoholismo.